Clinical trial inclusion criterion:
Fasting or postprandial plasma C-peptide more than 100 pmol/L

Annotated entities:
- Measurement: "postprandial plasma C-peptide"
- Measurement: "Fasting plasma C-peptide"
- Value: "more than 100 pmol/L"